The virus that causes FIP, Feline Infectious Peritonitis belongs to what family?

Feline coronavirus (FCoV) is an etiological agent that causes a benign enteric illness and the fatal systemic disease feline infectious peritonitis (FIP)